Uno de los siguientes fármacos NO se utiliza en el tratamiento de la hepatitis crónica B:
1. Entecavir.
2. Adefovir.
3. Tenofovir.
4. Sofosbuvir.

Respuesta correcta: 4. Sofosbuvir.